concomitant medical illness that in the opinion of the investigator is associated with a life expectancy < 1 year

The above is a clinical trial inclusion criterion. Annotated with entity spans:
[Condition: concomitant medical illness] that in the opinion of the investigator [Qualifier: is associated with a life expectancy < 1 year]